Complicated pharyngitis

The above is a clinical trial exclusion criterion. Annotated with entity spans:
[Qualifier: Complicated] [Condition: pharyngitis]